Clinical trial inclusion criterion:
Symptomatic, permanent AF of at least three months duration

Entity relations:
- Has_multiplier("AF", "at least three months duration")
- Has_qualifier("AF", "Symptomatic")
- Has_qualifier("AF", "permanent")